severe respiratory disease;

The above is a clinical trial exclusion criterion. Annotated with entity spans:
[Qualifier: severe] [Condition: respiratory disease];